Clinical trial exclusion criterion:
Existence of any surgical, medical or mental conditions, other than the current transplantation, which, in the opinion of the investigator, might interfere with the objectives of the study.

Entity relations:
- Has_temporal("transplantation", "current")
- Has_negation("transplantation", "other than")
- AND("surgical conditions", "transplantation")
- Has_qualifier("surgical conditions", "might interfere with the objectives of the study")
- OR("surgical conditions", "medical conditions", "mental conditions")